Clinical trial exclusion criterion:
Psychiatric, cognitive disorders, mental retardation;

Annotated entities:
- Condition: "Psychiatric, cognitive disorders"
- Condition: "mental retardation"